All patients admitted to the Duke CICU, who require intubation and sedation for mechanical ventilation that is expected to be >24 hours in duration will be included, unless they meet the specified exclusion criteria.

The above is a clinical trial inclusion criterion. Annotated with entity spans:
All patients [Procedure: admitted] to the [Visit: Duke CICU], who require [Procedure: intubation] and [Procedure: sedation] for [Procedure: mechanical ventilation] that is [Mood: expected to be] [Multiplier: >24 hours in duration] will be included, unless they meet the specified exclusion criteria.